Clinical trial exclusion criterion:
Current punctal plugging

Annotated entities:
- Temporal: "Current"
- Condition: "punctal plugging"